Clinical trial exclusion criterion:
Patients who are being prepared for surgery, or during or after surgery.

Entity relations:
- Has_mood("surgery", "being prepared for")
- OR("surgery", "after surgery", "during surgery")